How are super enhancers defined?

Super-enhancers comprise of clusters of enhancers that are typically defined by the ChIP-seq analysis for active histone marks. called super-enhancers, that recruit much of the cell's transcriptional apparatus and are defined by extensive acetylation of histone H3 lysine 27 (H3K27ac). Super-enhancers (SEs) are large clusters of transcriptional enhancers that drive expression of genes controlling cell identity.